Clinical trial inclusion criterion:
Subject is 65 years old who is able and willing to give an informed consent.

Annotated entities:
- Value: "65 years"
- Person: "old"
- Informed_consent: "able and willing to give an informed consent"